Multiple (> 1) bites

The above is a clinical trial exclusion criterion. Annotated with entity spans:
[Multiplier: Multiple] ([Multiplier: > 1]) [Condition: bites]